Clinical trial inclusion criterion:
Patients between 3 to 16 years of age undergoing adenotonsillectomy, with or without myringotomy or myringoplasty

Entity relations:
- Has_value("age", "between 3 to 16 years")
- Has_temporal("adenotonsillectomy", "undergoing")
- AND("adenotonsillectomy", "myringotomy")
- OR("myringotomy", "myringoplasty")